Willing and able to provide written informed consent

The above is a clinical trial inclusion criterion. Annotated with entity spans:
[Informed_consent: Willing and able to provide written informed consent]